Patients are of American Society of Anesthesiologists (ASA) physical status I and II, aged 8-14 years old, of both gender, with suspected acute appendicitis scheduled for laparoscopic appendicectomy.

The above is a clinical trial inclusion criterion. Annotated with entity spans:
Patients are of [Measurement: American Society of Anesthesiologists] ([Measurement: ASA]) physical status [Value: I and II], [Person: aged] [Value: 8-14 years old], of [Person: both gender], with [Mood: suspected] [Condition: acute appendicitis] [Mood: scheduled for] [Procedure: laparoscopic appendicectomy].